Lifetime history of Bipolar Disorder, Schizophrenia or Schizoaffective Disorder

The above is a clinical trial exclusion criterion. Annotated with entity spans:
[Temporal: Lifetime history] of [Condition: Bipolar Disorder], [Condition: Schizophrenia] or [Condition: Schizoaffective Disorder]